一個 2 歲男童因為先天巨細胞病毒（cytomegalovirus）感染一直在追蹤，該男童耳聾，且有發展遲緩情況。母親又懷孕，擔心這次懷孕的胎兒會有受到巨細胞病毒感染的風險。下列敘述何者錯誤？
A. 母親已有巨細胞病毒抗體
B. 母親的巨細胞病毒感染還是可能被活化
C. 此胎兒被巨細胞病毒感染造成與其 2 歲的哥哥同樣臨床症狀的機會不大
D. 此胎兒出生後必須與其 2 歲的哥哥隔離

正確答案：D. 此胎兒出生後必須與其 2 歲的哥哥隔離